any wound or infection related to puncture site

The above is a clinical trial exclusion criterion. Annotated with entity spans:
any [Condition: wound] or [Condition: infection] related to [Qualifier: puncture site]